Any history of pancreatic injury, pancreatitis or evidence of impaired pancreatic function/injury as indicated by abnormal lipase or amylase Evidence of hepatic disease, a history of hepatic encephalopathy, a history of esophageal varices, or a history of portocaval shunt

The above is a clinical trial exclusion criterion. Annotated with entity spans:
Any [Temporal: history] of [Condition: pancreatic injury], [Condition: pancreatitis] or evidence of [Value: impaired] [Measurement: pancreatic function]/injury as indicated by [Value: abnormal] [Measurement: lipase] or [Measurement: amylase] Evidence of [Condition: hepatic disease], a [Temporal: history] of [Condition: hepatic encephalopathy], a [Temporal: history] of [Condition: esophageal varices], or a [Temporal: history] of [Condition: portocaval shunt]